李君正在金門服兵役，近日返台休假因發燒及頭痛一週而求醫。理學檢查發現，其有皮膚紅疹及有約一公分大的焦痂在左腹股溝處。詢問病史，李先生陳述近月餘常至服役地點修剪雜草。就其病史及臨床徵候，李君最可能罹患何種疾病？
A. 戰壕熱（trench fever）
B. 地方性斑疹傷寒（endemic typhus）
C. 叢林斑疹傷寒（scrub typhus）
D. 流行性斑疹傷寒（epidemic typhus）

正確答案：C. 叢林斑疹傷寒（scrub typhus）